Clinical trial exclusion criterion:
Inability to comply with protocol required procedures.

Annotated entities:
- Condition: "Inability to comply with protocol required procedures."
- Undefined_semantics: "Inability to comply with protocol required procedures."
- Non-query-able: "Inability to comply with protocol required procedures."
- Post-eligibility: "Inability to comply with protocol required procedures."